Para el cuidado de las heridas y dependiendo de la evolución de las mismas, existe en el mercado una gran variedad de apósitos. De las siguientes afirmaciones, señale la correcta:
1. Las gasas mantienen siempre la herida en condiciones húmedas.
2. El apósito de Hidrogel se utiliza para mantener una herida seca.
3. Para las heridas infectadas se utilizan películas transparentes.
4. Los apósitos hidrocoloides se utilizan en curas de ambiente húmedo.
5. El apósito de espuma se utiliza para mantener un ambiente seco en la herida.

Respuesta correcta: 4. Los apósitos hidrocoloides se utilizan en curas de ambiente húmedo.